Clinical trial inclusion criteria:
traumatic spinal cord injury at least one year ago
regular bowel care routine (at least four weeks)

Annotated entities:
- Condition: "traumatic spinal cord injury"
- Temporal: "at least one year ago"
- Observation: "regular bowel care routine"
- Temporal: "at least four weeks"